Clinical trial exclusion criterion:
Pregnant females

Annotated entities:
- Condition: "Pregnant"
- Person: "females"